Clinical trial inclusion criterion:
HIV positive with documentation present in source document.

Entity relations:
- Has_value("HIV", "positive")